Clinical trial inclusion criteria:
Age = 75 years,
Severe, symptomatic aortic stenosis,
High risk for cardiac surgery (STS and logistic Euroscore ),
According multidisciplinary (heart) team decision TAVI is preferable,
Willing to participate

Annotated entities:
- Person: "Age"
- Value: "= 75 years"
- Qualifier: "Severe"
- Qualifier: "symptomatic"
- Condition: "aortic stenosis"
- Qualifier: "High risk"
- Procedure: "cardiac surgery"
- Qualifier: "STS"
- Qualifier: "logistic Euroscore"
- Non-representable: "According multidisciplinary (heart) team decision TAVI is preferable,"
- Competing_trial: "Willing to participate"